在胎兒循環中，下列何處血液的含氧量最高？
A. 上腔靜脈（superior vena cava）
B. 主動脈（aorta）
C. 右心室（right ventricle）
D. 靜脈導管（ductus venosus）

正確答案：D. 靜脈導管（ductus venosus）